Condomless sex in the last 3 months with one or more male partners of unknown HIV status known to be at substantial risk of HIV infection (IDU, bisexual, sex for goods, recently incarcerated, from a country with HIV prevalence >1%, interpersonal Partner Violence);

The above is a clinical trial inclusion criterion. Annotated with entity spans:
[Observation: Condomless sex] [Temporal: in the last 3 months] with [Multiplier: one or more] [Person: male partners] of [Condition: unknown HIV status] known to be at [Observation: substantial risk of HIV infection] ([Observation: IDU], [Observation: bisexual], [Observation: sex for goods], [Observation: recently incarcerated], [Observation: from a country with HIV prevalence >1%], [Observation: interpersonal Partner Violence]);